Clinical trial inclusion criterion:
Subjects with PID, eg, with a diagnosis of common variable immunodeficiency or X-linked agammaglobulinemia, as defined by the Pan American Group for Immune Deficiency and the European Society of Immune Deficiencies.

Entity relations:
- AND("Pan American Group for Immune Deficiency", "common variable immunodeficiency")
- OR("Pan American Group for Immune Deficiency", "European Society of Immune Deficiencies")
- OR("common variable immunodeficiency", "X-linked agammaglobulinemia")